Women of child-bearing potential that do not practice adequate contraception.

The above is a clinical trial exclusion criterion. Annotated with entity spans:
[Person: Women] of [Condition: child-bearing potential] that [Negation: do not] practice [Procedure: adequate contraception].